Patients:

The above is a clinical trial exclusion criterion. Annotated with entity spans:
[Parsing_Error: Patients:]